El paciente puede retirar libremente su consentimiento:
1. En cualquier momento.
2. Sólo antes de haberlo firmado.
3. Sólo a través de terceras personas si lo ha firmado previamente.
4. Sólo cuando lo haya otorgado verbalmente pero no si lo ha hecho por escrito.
5. Si tiene firmadas las “voluntades anticipadas”.

Respuesta correcta: 1. En cualquier momento.